What are 3 symptoms of Waardenburg Syndrome?

Waardenburg syndrome  is a rare genetic disorder of neural crest cells (NCC) characterized by congenital sensorineural hearing loss, dystopia canthorum, and abnormal iris pigmentation.